Son reservorios de la fiebre Q (Coxiella burnetti) los (las):
1. Murciélagos.
2. Aves de corral.
3. Roedores.
4. Perros.
5. Vacas, ovejas y cabras.

Respuesta correcta: 5. Vacas, ovejas y cabras.